long-term use of analgesics,sedatives or non steroidal anti-inflammatory drugs history.

The above is a clinical trial exclusion criterion. Annotated with entity spans:
[Multiplier: long-term use] of [Drug: analgesics],[Drug: sedatives] or [Drug: non steroidal anti-inflammatory drugs] [Temporal: history].